Clinical trial exclusion criteria:
Patients requiring emergent cesarean birth
Patients allergic to lidocaine or adhesive
Patients who have already received an epidural during this admission or requiring general anesthesia for cesarean birth
Patients using chronic oral neuromodulators
Patients with cardiac disease or using anti-arrhythmic agents
Patients with fibromyalgia or chronic pain syndromes such as rheumatoid arthritis, osteoarthritis, or lupus.
Daily narcotic or opiate use for greater than the 2 months prior to enrollment in the study.

Annotated entities:
- Procedure: "emergent cesarean birth"
- Condition: "allergic"
- Drug: "lidocaine"
- Drug: "adhesive"
- Procedure: "epidural"
- Temporal: "during this admission"
- Mood: "requiring"
- Procedure: "general anesthesia"
- Procedure: "cesarean birth"
- Drug: "chronic oral neuromodulators"
- Drug: "anti-arrhythmic agents"
- Condition: "cardiac disease"
- Condition: "fibromyalgia"
- Condition: "chronic pain syndromes"
- Condition: "rheumatoid arthritis"
- Condition: "osteoarthritis"
- Condition: "lupus"
- Drug: "narcotic"
- Multiplier: "Daily"
- Drug: "opiate"
- Temporal: "for greater than the 2 months prior to enrollment in the study"
- Reference_point: "enrollment in the study"